What is the interaction between WAPL and PDS5 proteins?

We propose that Wapl and Pds5 directly modulate conformational changes of cohesin to make it competent for dissociation from chromatin during prophase. Nipped-B, Pds5, and the Wapl protein that interacts with Pds5 all play unique roles in cohesin chromosome binding. Translocation ability is suppressed in the presence of Wapl-Pds5 and Sororin